Clinical trial exclusion criterion:
Allergic to or intolerant of investigational medications

Annotated entities:
- Condition: "Allergic"
- Condition: "intolerant"
- Drug: "investigational medications"